Male or female of aged 50 years or older

The above is a clinical trial inclusion criterion. Annotated with entity spans:
[Person: Male] or [Person: female] of [Person: aged] [Value: 50 years or older]